Cuando valora a un paciente con un problema neurológico, usted comprueba que presenta signo de Kerning positivo. Este hallazgo se relaciona con:
1. Irritación meníngea.
2. Crisis convulsivas.
3. Alteración del I Par Craneal.
4. Diplopía.
5. Infarto cerebral.

Respuesta correcta: 1. Irritación meníngea.